Los inhibidores competitivos de las enzimas:
1. Se unen al complejo enzima-sustrato de forma irreversible.
2. Se unen al complejo enzima-sustrato en un sitio distinto del centro activo.
3. Compiten con el sustrato por su unión reversible al centro activo.
4. Modifican únicamente la eficacia catalítica de las enzimas.

Respuesta correcta: 3. Compiten con el sustrato por su unión reversible al centro activo.